What is the use of the CAHP score?

CAHP (cardiac arrest hospital prognosis) score is used to evaluate prognosis after cardiac arrest.